引起小兒急性感染性腹瀉的病原體中，下列何者會引起非發炎性腹瀉（non-inflammatory diarrhea）？
A. 空腸曲狀桿菌（Campylobacter jejuni）
B. 沙門氏菌（Salmonella spp.）
C. 赤痢桿菌（Shigella spp.）
D. 霍亂弧形菌（Vibrio cholerae）

正確答案：D. 霍亂弧形菌（Vibrio cholerae）